關於嬰兒搖晃症（Shaken baby syndrome）之成因，下列何者較正確？
A. 多因坐在嬰兒搖椅造成
B. 多因照顧者搖抱哄睡造成
C. 多因照顧者惡意搖晃造成
D. 多因照顧者與嬰兒玩耍造成

正確答案：C. 多因照顧者惡意搖晃造成